Clinical trial exclusion criterion:
Other respiratory disorders: Subjects with active tuberculosis, lung cancer, bronchiectasis, sarcoidosis, pulmonary fibrosis, pulmonary hypertension, interstitial lung diseases or other active pulmonary diseases.

Annotated entities:
- Condition: "tuberculosis"
- Condition: "Other respiratory disorders"
- Undefined_semantics: "Other respiratory disorders"
- Condition: "lung cancer"
- Condition: "bronchiectasis"
- Condition: "sarcoidosis"
- Condition: "pulmonary fibrosis"
- Condition: "pulmonary hypertension"
- Condition: "interstitial lung diseases"
- Condition: "active pulmonary diseases"